Clinical trial inclusion criterion:
Have a cervical dilation of 2 centimeters or less, measured at the level of the internal os

Entity relations:
- Has_multiplier("cervical dilation", "2 centimeters or less")
- Has_qualifier("cervical dilation", "internal os")